Clinical trial inclusion criterion:
Fasting glucose >140 mg/dl or random glucose >180 mg/dl

Entity relations:
- Has_value("Fasting glucose", ">140 mg/dl")
- Has_value("random glucose", ">180 mg/dl")
- OR("Fasting glucose", "random glucose")